What is Cellbase?

CellBase, a comprehensive collection of RESTful web services for retrieving relevant biological information from heterogeneous sources.